What illness is transmitted by the Lone Star Tick, Amblyomma americanum?

Amblyomma americanum (Lone star tick) is an important disease vector in the United States. It transmits several human pathogens, including the agents of human monocytic ehrlichiosis, tularemia, and southern tick-associated rash illness [STARI] or Masters disease